針對可以引起氣喘等第一型過敏性疾病之過敏原，下列那一項敘述最正確？
A. 與一般抗原相同，都需經抗原呈獻細胞作用來活化T細胞
B. 同卵雙胞胎對特定過敏原都會有相同的反應
C. 都具有蛋白水解酶（protease）的功能
D. 病人體內都可以檢測出對過敏原具特異性的IgE

正確答案：A. 與一般抗原相同，都需經抗原呈獻細胞作用來活化T細胞